Clinical trial exclusion criterion:
Limited life expectancy due to cancer or end-stage renal or liver disease

Entity relations:
- Has_value("life expectancy", "Limited")
- AND("life expectancy", "cancer")
- OR("cancer", "liver disease", "end-stage renal disease")